Clinical trial inclusion criterion:
ASA (american society of anesthesiologists) class 1-3

Entity relations:
- Has_value("ASA class", "1-3")
- Subsumes("ASA class", "american society of anesthesiologists")